製造血液中白蛋白（albumin）的主要場所為？
A. 小腸
B. 脾臟
C. 胰臟
D. 肝臟

正確答案：D. 肝臟